Clinical trial inclusion criterion:
BMI < 28

Entity relations:
- Has_value("BMI", "< 28")